Clinical trial inclusion criterion:
Adult patients ≥ 19 years of age who are able to freely provide informed consent

Annotated entities:
- Person: "Adult"
- Value: "≥ 19 years"
- Person: "age"
- Observation: "able to freely provide informed consent"